一位 77 歲女性病人因大腸癌住院，肝臟掃描發現已有肝轉移。病房護理人員告知病人之女兒與兒子病情。病人女兒立即聯繫醫師，堅持不能讓她的母親知道病情，以免情緒崩潰。則醫師該如何處理？
A. 盡快將病情告知病人，請病人的女兒不要干擾
B. 告訴病人的兒女，這不是他們能決定的，整件事由醫師處理
C. 堅定的告訴病人的女兒，醫師一定會找各種機會告知病人詳情
D. 請家屬召開家庭會議，與醫師共同討論如何告知病人病情的細節

正確答案：D. 請家屬召開家庭會議，與醫師共同討論如何告知病人病情的細節